下列何者不是常用的病態性肥胖（morbid obesity）定義？
A. 體重比理想體重多 100 磅
B. 體重為理想體重的 2 倍
C. 身體質量指數（body mass index）大於 40 kg/m2
D. 身體體表面積（body surface area）大於 2.0 m2

正確答案：D. 身體體表面積（body surface area）大於 2.0 m2